Clinical trial exclusion criterion:
Desire for conception in the next 12 months

Entity relations:
- Has_temporal("conception", "in the next 12 months")
- Has_mood("conception", "Desire")